Patients provided written informed consent;

The above is a clinical trial inclusion criterion. Annotated with entity spans:
Patients [Observation: provided written informed consent];